Clinical trial inclusion criterion:
female infertile patients eligible for IVF treatment

Annotated entities:
- Person: "female"
- Condition: "infertile"
- Mood: "eligible"
- Procedure: "IVF treatment"